Clinical trial inclusion criterion:
patients with =20° passive extension deficit (PED) in metacarpophalangeal (MP) or proximal interphalangeal (PIP) joint, or TPED of =30° in MP and PIP joints of finger/fingers II-V

Entity relations:
- Has_qualifier("passive extension deficit (PED)", "=20°")
- Has_qualifier("passive extension deficit (PED)", "proximal interphalangeal (PIP) joint")
- Has_qualifier("TPED", "=30°")
- Has_qualifier("TPED", "MP")
- Has_qualifier("TPED", "PIP joints")
- Has_qualifier("TPED", "finger/fingers II-V")
- OR("proximal interphalangeal (PIP) joint", "joint metacarpophalangeal (MP)")